Describe the application of whole genome sequencing in the diagnosis of primary ciliary dyskinesia (PCD)

Genetic testing is an important component of diagnosing PCD, especially in cases of atypical disease history. WGS is effective in cases where prior gene panel testing has found no variants or only heterozygous variants. In these cases it may detect SVs and is a powerful tool for novel gene discovery.